Clinical trial exclusion criterion:
4. WHO clinical classification Groups 2-5

Annotated entities:
- Parsing_Error: "4."
- Measurement: "WHO clinical classification"
- Value: "Groups 2-5"